10. Myocardial infarction within the past 6 months.

The above is a clinical trial exclusion criterion. Annotated with entity spans:
[Parsing_Error: 10.] [Condition: Myocardial infarction] [Temporal: within the past 6 months].